Clinical trial exclusion criterion:
Patients taking psychotropic medications or illicit drugs that may alter cognition, concentration, or behavior. Appropriate treatment by a licensed provider with medications for depression or anxiety, including but not limited to SSRIs, SNRIs, and standard dose benzodiazepines at a stable dose, is permitted

Annotated entities:
- Drug: "psychotropic medications"
- Drug: "illicit drugs"
- Condition: "alter cognition"
- Condition: "alter concentration"
- Condition: "alter behavior"
- Non-representable: "Appropriate treatment by a licensed provider with medications for depression or anxiety, including but not limited to SSRIs, SNRIs, and standard dose benzodiazepines at a stable dose, is permitte"